Any systemic infection during the study.

The above is a clinical trial exclusion criterion. Annotated with entity spans:
Any [Qualifier: systemic] [Condition: infection] [Temporal: during the study].